Clinical trial exclusion criterion:
Subject has any significant congenital heart defect corrected or not (except for patent foramen ovale that is allowed).

Entity relations:
- Has_qualifier("congenital heart defect", "significant")
- Has_negation("patent foramen ovale", "except")